La enfermedad de Von Gierke es un déficit del enzima:
1. Glucógeno fosforilasa muscular.
2. Enzima ramificante.
3. Glucógeno fosforilasa hepática.
4. Glucosa 6-fosfatasa.
5. Glucógeno sintasa.

Respuesta correcta: 4. Glucosa 6-fosfatasa.